Clinical trial exclusion criterion:
Treated with hydroxyurea within 30 days;

Entity relations:
- Has_temporal("hydroxyurea", "within 30 days")